4. On a stable and recommended dose of UDCA for the past twelve months

The above is a clinical trial inclusion criterion. Annotated with entity spans:
[Parsing_Error: 4.] On a [Qualifier: stable] and [Qualifier: recommended dose] of [Drug: UDCA] [Temporal: for the past twelve months]